下列之寄生蟲配對中，何者在患者組織切片皆可能檢出其囊體期（cyst stage）？
A. 哈氏阿米巴（Entamoeba hartmanni）及棘阿米巴（Acanthamoeba spp.）
B. 棘阿米巴（Acanthamoeba spp.）及痢疾阿米巴（Entamoeba histolytica）
C. 棘阿米巴（Acanthamoeba spp.）及巴氏阿米巴（Balamuthia mandrillaris）
D. 棘阿米巴（Acanthamoeba spp.）及福氏內格里阿米巴（Naegleria fowleri）

正確答案：C. 棘阿米巴（Acanthamoeba spp.）及巴氏阿米巴（Balamuthia mandrillaris）